More than 4 previous embryo transfers

The above is a clinical trial exclusion criterion. Annotated with entity spans:
[Multiplier: More than 4] [Temporal: previous] [Procedure: embryo transfers]